Clinical trial exclusion criterion:
contra-indication to the use of rocuronium

Entity relations:
- AND("contra-indication", "rocuronium")